Clinical trial inclusion criteria:
Age: 60-85 years, right-handed;
Diagnosis: Major depression, unipolar (by Structured Clinical Interview for Diagnostic and Statistical Manual (DSM)IV (SCID-R) and DSM-IV criteria);
Age of onset of first episode = 50 years with up to three depressive episodes;
Severity of depression: A 24-Item Hamilton Depression Rating Scale (HDRS) = 20.

Annotated entities:
- Person: "Age"
- Value: "60-85 years"
- Observation: "right-handed"
- Condition: "Major depression"
- Qualifier: "unipolar"
- Measurement: "IV Structured Clinical Interview for Diagnostic and Statistical Manual"
- Measurement: "DSM-IV criteria)"
- Measurement: "DSM"
- Measurement: "SCID"
- Condition: "onset of first episode"
- Person: "Age"
- Value: "= 50 years"
- Multiplier: "three"
- Condition: "depressive episodes"
- Condition: "depression"
- Measurement: "24-Item Hamilton Depression Rating Scale"
- Measurement: "HDRS"
- Value: "= 20"